下列有關膽酸（bile acid）的敘述，何者錯誤？
A. 無法經食物攝取獲得
B. 由肝臟合成
C. 絕大部分在空腸（jejunum）再吸收
D. 原發性膽道肝硬化（primary biliary cirrhosis）患者因膽酸分泌發生問題而可能產生steatorrhea，甚至因此而導致鈣和維生素Ｄ的吸收不良

正確答案：C. 絕大部分在空腸（jejunum）再吸收